elective procedure

The above is a clinical trial inclusion criterion. Annotated with entity spans:
[Procedure: elective procedure]